Clinical trial exclusion criterion:
chronic kidney disease

Annotated entities:
- Condition: "chronic kidney disease"